En psicología se denominan “ilusiones” a:
1. Los engaños perceptivos.
2. Las pseudoalucinaciones.
3. Las asociaciones anormales de las sensaciones (sinestesias).
4. Las anomalías de la integración perceptiva (morfolisis).
5. Las anomalías en la estructuración de estímulos ambiguos.

Respuesta correcta: 5. Las anomalías en la estructuración de estímulos ambiguos.